What does davunetide do to microtubules?

Davunetide or NAP is a microtubule-stabilizer.